Clinical trial inclusion criterion:
Smokes = 1 cigarette per day (cpd)

Entity relations:
- Has_multiplier("Smokes", "= 1 cigarette per day")